一位38歲電子業公司總經理近兩個月體溫均在37.5至38.0℃左右，就診時主訴身體虛弱，無運動時呼吸困難症狀，但有心悸現象，身體檢查有貧血，血壓120/70 mmHg，心跳規則94/min，體溫38.1℃，肝腎功能正 常，心臟觸診有左心室起伏（LV heave），聽診有grade III/VI全收縮期心雜音，在心尖處最大聲，無明顯全身性或四肢動脈栓塞的現象。心臟超音波檢查在二尖瓣（僧帽瓣）有一約15 mm飄動的贅生物，而在左右手分別採取的血液檢體培養均長出 Streptococcus viridans。下列何者是適當的初步治療計畫？
A. 每8小時靜脈注射penicillin G二百萬到三百萬單位4週後考慮手術治療
B. 每4小時靜脈注射penicillin G二百萬到三百萬單位4週後考慮手術治療
C. 每4小時靜脈注射penicillin G二百萬到三百萬單位加上每8小時靜脈注射gentamicin 1 mg/kg，二週後如未發
D. 靜脈注射ampicillin每4小時2g加上每8小時靜脈注射gentamicin 1 mg/kg共4至6週後，考慮外科手術治療瓣膜病變

正確答案：B. 每4小時靜脈注射penicillin G二百萬到三百萬單位4週後考慮手術治療